suspected obstructive choledocholithiasis

The above is a clinical trial exclusion criterion. Annotated with entity spans:
[Mood: suspected] [Condition: obstructive choledocholithiasis]